一位接受美沙冬替代療法之 40 歲男性患者至精神科急診就醫，檢查發現該患者之意識模糊、言辭含糊、無法回答問話，且其瞳孔縮小有如針頭一般。下列何者為其最可能之臨床診斷？
A. 安非他命戒斷
B. 安非他命中毒
C. 海洛因戒斷
D. 海洛因中毒

正確答案：D. 海洛因中毒